Clinical trial exclusion criterion:
A prospective subject should not be included in the study until the condition has resolved or the febrile event has subsided.

Annotated entities:
- Non-query-able: "A prospective subject should not be included in the study until the condition has resolved or the febrile event has subsided."
- Not_a_criteria: "A prospective subject should not be included in the study until the condition has resolved or the febrile event has subsided."